Known renovascular hypertension or evidence of pulmonary hypertension (pulmonary vascular resistance > 6 Wood units) unresponsive to vasodilator agents such as oxygen, nitroprusside, or nitric oxide

The above is a clinical trial exclusion criterion. Annotated with entity spans:
Known [Condition: renovascular hypertension] or [Mood: evidence of] [Condition: pulmonary hypertension] ([Measurement: pulmonary vascular resistance] [Value: > 6 Wood units]) [Qualifier: unresponsive to vasodilator agents] such as [Drug: oxygen], [Drug: nitroprusside], or [Drug: nitric oxide]